Clinical trial exclusion criterion:
Congestive heart failure, history of ventricular tachycardia, ventricular fibrillation or multifocal ventricular extrasystoles or QTc prolongation.

Annotated entities:
- Condition: "Congestive heart failure"
- Condition: "ventricular tachycardia"
- Temporal: "history of"
- Condition: "ventricular fibrillation"
- Condition: "multifocal ventricular extrasystoles"
- Condition: "QTc prolongation"